Hemoglobin A1c (HbA1C) > 11%

The above is a clinical trial exclusion criterion. Annotated with entity spans:
[Measurement: Hemoglobin A1c (HbA1C)] [Value: > 11%]